下列何者不屬於肥大性胃病（hypertrophic gastropathy）？
A. Ménétrier 氏病（Ménétrier disease）
B. Zollinger-Ellison 症候群
C. 胃增生性息肉（gastric hyperplastic polyp）
D. 肥大性過度分泌性胃病（hypertrophic-hypersecretory gastropathy）

正確答案：C. 胃增生性息肉（gastric hyperplastic polyp）